Clinical trial exclusion criteria:
Active alcohol or drug use or dependence which may interfere with adherence to study requirements
HIV-infected at screening or enrollment
Estimated CrCl < 60 mL/min
Past participation in an HIV vaccine study
Positive Hepatitis B surface antigen test
Underlying medical condition with survival unlikely during follow-up period
Any condition that in the opinion of study staff would make participation in the study unsafe or interfere with achieving study objectives
Pregnant or breast feeding
Actively trying to achieve pregnancy

Annotated entities:
- Intoxication_considerations: "Active alcohol or drug use or dependence which may interfere with adherence to study requirements"
- Condition: "HIV-infected"
- Temporal: "at screening"
- Temporal: "at enrollment"
- Measurement: "Estimated CrCl"
- Value: "< 60 mL/min"
- Non-query-able: "Past participation in an HIV vaccine study"
- Value: "Positive"
- Measurement: "Hepatitis B surface antigen test"
- Condition: "medical condition"
- Condition: "survival unlikely"
- Condition: "condition"
- Qualifier: "make participation in the study unsafe"
- Qualifier: "interfere with achieving study objectives"
- Condition: "Pregnant"
- Observation: "breast feeding"
- Pregnancy_considerations: "Actively trying to achieve pregnanc"